¿Cuál de las siguientes manifestaciones clínicas es la predominante en un paciente con pancreatitis aguda?
1. Abdomen rígido o en tabla.
2. Equimosis en el flanco o alrededor del ombligo.
3. Fiebre.
4. Ictericia.
5. Dolor abdominal.

Respuesta correcta: 5. Dolor abdominal.